En cromatografía de gases, las columnas que contienen como fase estacionaria un 100 % de dimetil polixiloxano son:
1. Totalmente polares.
2. Bastantes polares.
3. Totalmente no polares.
4. De polaridad intermedia.

Respuesta correcta: 3. Totalmente no polares.